Woman who had 2 miscarriage before 12(th) week of gestation.The patient who is diagnosed as thrombophilia with recurrent pregnancy loss. Signed consent form.

The above is a clinical trial inclusion criterion. Annotated with entity spans:
[Person: Woman] who had [Multiplier: 2] [Condition: miscarriage] [Qualifier: before 12(th) week of gestation].The patient who is diagnosed as [Condition: thrombophilia] with [Multiplier: recurrent] [Condition: pregnancy loss]. [Informed_consent: Signed consent form.]